Clinical trial inclusion criterion:
Previous therapy with BBIT (basal insulin and at least once daily bolus insulin)

Annotated entities:
- Temporal: "Previous"
- Procedure: "therapy"
- Drug: "BBIT"
- Drug: "basal insulin and at least once daily bolus insulin"